Clinical trial exclusion criterion:
Patient whom the surgery is withhold or canceled

Entity relations:
- Has_context("surgery", "withhold")
- OR("withhold", "canceled")